What nerve is involved in carpal tunnel syndrome?

Carpal tunnel syndrome (CTS) is a focal compressive neuropathy of the median nerve at the level of the wrist.